2. Non-smoker

The above is a clinical trial inclusion criterion. Annotated with entity spans:
2. [Condition: Non-smoker]